Clinical trial exclusion criterion:
current antibiotic use.

Entity relations:
- Has_temporal("antibiotic use", "current")